Clinical trial exclusion criterion:
Life-time history of DSM 5 schizophrenia, bipolar disorder, or previous psychosis with or intolerance to cannabinoids

Entity relations:
- AND("intolerance", "cannabinoids")
- Has_qualifier("schizophrenia", "DSM 5")
- OR("schizophrenia", "bipolar disorder", "psychosis", "intolerance")